Clinical trial exclusion criterion:
Congestive heart failure (patients with LVEF <30% or cardiogenic shock)

Entity relations:
- Has_value("LVEF", "<30%")
- Subsumes("Congestive heart failure", "<30%")
- AND("<30%", "cardiogenic shock")
- OR("LVEF", "cardiogenic shock")